攝護腺癌之根除手術，常做神經保留手術（Nerve Sparing Technique）主要是要避免術後發生：
A. 排尿困難
B. 尿失禁
C. 勃起功能障礙
D. 射精功能障礙

正確答案：C. 勃起功能障礙